Clinical trial exclusion criterion:
History of open bladder, rectosigmoid colon, or other pelvic surgery

Entity relations:
- Subsumes("pelvic surgery", "rectosigmoid colon surgery")
- Subsumes("pelvic surgery", "open bladder surgery")